What is caused by SCUBE3 loss of function?

SCUBE3 is a BMP2/BMP4 co-receptor. It is responsible for the development of bone and teeth. When it is not functioning properly, it inhibits the growth and development of these tissues.